某多胜肽（polypeptide）在其等電點pH（isolelectric pH）的溶液中，該多胜肽的電荷為何？
A. 胺基（amino）和羧基（carboxyl）末端（termini）皆帶正電荷
B. 胺基和羧基末端皆不帶電荷
C. 淨電荷為零
D. 帶有四個淨電荷

正確答案：C. 淨電荷為零